Clinical trial inclusion criterion:
No previous treatment with hematopoietic growth factors within 3 months prior to screening

Entity relations:
- Has_index("within 3 months prior to screening", "screening")
- Has_temporal("hematopoietic growth factors", "within 3 months prior to screening")